Patients with cardiac, pulmonary, hepatic, or renal dysfunction, epilepsy, or uncontrolled hypertension, or those taking medications that influence the central nervous system, are excluded from the study. Patients who show obvious alteration of mental status, or refuse to participate, are also excluded from the study.

The above is a clinical trial exclusion criterion. Annotated with entity spans:
Patients with [Condition: cardiac], [Condition: pulmonary], [Condition: hepatic], or [Condition: renal dysfunction], [Condition: epilepsy], or [Qualifier: uncontrolled] [Condition: hypertension], or those taking [Drug: medications that influence the central nervous system], are excluded from the study. Patients who show obvious [Condition: alteration of mental status], or [Observation: refuse to participate], are also excluded from the study.